Clinical trial exclusion criterion:
Neuropsychiatric illness

Annotated entities:
- Condition: "Neuropsychiatric illness"